Clinical trial inclusion criterion:
benign disease

Annotated entities:
- Condition: "benign disease"